病人長期下背痛，影像學檢查發現 L4 椎體對 L5 椎體之脊椎滑脫症（spondylolisthesis）。以下何者最不可能？
A. L4 關節間部（pars interarticularis）之缺陷或斷裂
B. L5 關節間部之缺陷或斷裂
C. L4-5 小面關節（facet joint）之骨關節炎及移位
D. L4 或 L5 神經根（nerve root）受到壓迫

正確答案：B. L5 關節間部之缺陷或斷裂